在美國運動醫學院訂定的綱要（American College of Sports Medicine's Guideline）中，對正常人心肺耐力 訓練（cardiorespiratory endurance training）的建議，下列描述何者正確？
A. 以小肌肉群的靜態運動（static exercise of small muscle groups）為主
B. 以有不同阻力的重力訓練機器（variable resistance weight machines）為輔助
C. 每週進行3～5天的訓練
D. 每次進行10～20分

正確答案：C. 每週進行3～5天的訓練